Clinical trial exclusion criteria:
Contraindication to sitagliptin or metformin or thiazolidinedione
Pregnant or breast feeding women
Type 1 diabetes, gestational diabetes, or secondary forms of diabetes
Not appropriate for oral antidiabetic agent
Medication which affect glycemic control
Disease which affect efficacy and safety of drugs
Any major illness (Liver disease, Renal failure, Heart disease, Cancer, etc)

Annotated entities:
- Drug: "sitagliptin"
- Drug: "metformin"
- Drug: "thiazolidinedione"
- Condition: "Contraindication"
- Condition: "Pregnant"
- Condition: "breast"
- Condition: "Type 1 diabetes"
- Condition: "gestational diabetes"
- Condition: "secondary forms of diabetes"
- Negation: "Not"
- Observation: "appropriate"
- Drug: "oral antidiabetic agent"
- Drug: "Medication"
- Observation: "affect glycemic control"
- Drug: "Disease"
- Qualifier: "affect efficacy"
- Qualifier: "safety of drugs"
- Condition: "major illness"
- Condition: "Liver disease"
- Condition: "Renal failure"
- Condition: "Heart disease"
- Condition: "Cancer"